Clinical trial inclusion criterion:
Mental or nervous system disorders.

Annotated entities:
- Condition: "Mental disorders"
- Condition: "nervous system disorders"